Clinical trial exclusion criterion:
Previous history of pneumonitis.

Annotated entities:
- Condition: "pneumonitis"
- Temporal: "history"